Clinical trial exclusion criterion:
Platelet count < 105/mm3;

Entity relations:
- Has_value("Platelet count", "< 105/mm3")